Clinical diagnosis of chronic plaque-type psoriasis of the body

The above is a clinical trial inclusion criterion. Annotated with entity spans:
Clinical diagnosis of [Qualifier: chronic] [Qualifier: plaque-type] [Condition: psoriasis of the body]